下列有關睡眠衛生之敘述，何者錯誤？
A. 準時起床
B. 儘量臨睡前吃飽可助眠
C. 不宜睡前一直看電視
D. 一直睡不著宜暫時離開床鋪

正確答案：B. 儘量臨睡前吃飽可助眠